下列關於 progressive multifocal leukoencephalopathy（PML）的敘述，何者錯誤？
A. 常發生於免疫不全的病人
B. 由 BK 病毒所引起
C. 是一種脫髓鞘（demyelination）的疾病
D. 病人大部分 2 年內會死亡

正確答案：B. 由 BK 病毒所引起